一名 20 歲女性，過去幾年來她常覺得吞嚥困難，偶爾也會發生被食物嗆到的情形。上消化道攝影檢查發現遠端食道括約肌上方有明顯擴張現象。食道遠端的切片檢查也發現沒有神經元的存在。下列何者是最可能的診斷？
A. 失弛張症（achalasia）
B. Barrett 氏食道（Barrett's esophagus）
C. 裂孔疝脫（hiatal hernia）
D. Mallory-Weiss syndrome

正確答案：A. 失弛張症（achalasia）